Clinical trial exclusion criteria:
Conversion from laparoscopic to open surgery
History of Chronic pain or ongoing treatment for chronic pain
Age less than 18 yrs
Allergy to local anesthetics

Annotated entities:
- Non-representable: "Conversion from laparoscopic to open surgery"
- Temporal: "History"
- Condition: "Chronic pain"
- Condition: "chronic pain"
- Temporal: "ongoing"
- Procedure: "treatment"
- Person: "Age"
- Value: "less than 18 yrs"
- Condition: "Allergy"
- Drug: "local anesthetics"